一位 40 歲的水電工，時常拿著電鑽及鐵槌作工，來看診時主訴右手掌面麻木，Thenar 肌肉萎縮，手腕持續屈曲 60 秒後症狀加重，他那條神經被壓迫？
A. 尺神經
B. 正中神經
C. 橈神經
D. 臂神經

正確答案：B. 正中神經